Clinical trial exclusion criterion:
3. Serious status of illness, such as severe renal failure whose creatinine clearance<30 ml/min, New York Heart Association grade III or grade IV congestive heart failure, or hemodynamic instability, etc.

Entity relations:
- Has_value("creatinine clearance", "<30 ml/min")
- Has_qualifier("renal failure", "severe")
- Has_value("New York Heart Association", "grade III or grade IV")
- AND("congestive heart failure", "New York Heart Association")
- Subsumes("severe", "creatinine clearance")
- Subsumes("Serious status of illness", "renal failure")
- OR("renal failure", "congestive heart failure", "hemodynamic instability")